Singleton pregnancy;

The above is a clinical trial inclusion criterion. Annotated with entity spans:
[Condition: Singleton pregnancy];